Acude a consultas de pediatría un niño de 13 años de edad por presentar sensación de pirosis durante y tras las comidas y disfagia ocasional, que aumenta con la ingesta de alimentos sólidos como la carne. En los antecedentes familiares destacar que su madre está diagnosticada de hernia hiatal. En los antecedentes personales nos refiere alergia a pólenes, ácaros y látex. En la exploración física, no muestra hallazgos significativos salvo lesiones eccematosas en huecos poplíteos y antecubitales. ¿Cuál de las siguientes pruebas complementarias NO realizaría de acuerdo a los diagnósticos más probables?
1. Endoscopia digestiva superior.
2. pHmetría esofágica de 24 horas.
3. Test de aliento con carbono 13 para Helicobacter pylori.
4. Estudio baritado esófago-gastro-duodenal.

Respuesta correcta: 3. Test de aliento con carbono 13 para Helicobacter pylori.